Describe LowMACA

LowMACA is designed to visualize and statistically assess potential driver genes through the identification of their mutational hotspots.